Concomitant participation in another clinical study

The above is a clinical trial exclusion criterion. Annotated with entity spans:
[Temporal: Concomitant] [Observation: participation in another clinical study]